Body Mass Index (BMI) >21 kg/m^2 and <35 kg/m^2.

The above is a clinical trial inclusion criterion. Annotated with entity spans:
[Measurement: Body Mass Index (BMI)] [Value: >21 kg/m^2 and <35 kg/m^2].